Which method is behind HipMCL?

HipMCL (HipClustering) is a high-performance parallel implementation of the Markov clustering algorithm for large-scale networks.